Subject has sustained pathologic fractures of the vertebra or multiple fractures of the vertebra or hip.

The above is a clinical trial exclusion criterion. Annotated with entity spans:
Subject has sustained [Qualifier: pathologic] [Condition: fractures of the vertebra] or [Multiplier: multiple] [Condition: fractures of the vertebra] or hip.